benign prostatic hyperplasia

The above is a clinical trial exclusion criterion. Annotated with entity spans:
[Condition: benign prostatic hyperplasia]